Clinical trial exclusion criteria:
Uncontrolled diabetes
Ulcer infection
Non-diabetic ulcers Orthopedic or neuromuscular pathologic conditions

Annotated entities:
- Qualifier: "Uncontrolled"
- Condition: "diabetes"
- Condition: "Ulcer infection"
- Qualifier: "Non-diabetic"
- Condition: "ulcers"
- Condition: "Orthopedic pathologic conditions"
- Condition: "neuromuscular pathologic conditions"
- Line: "Orthopedic or neuromuscular pathologic conditions"
- Line: "Non-diabetic ulcers"